Clinical trial inclusion criterion:
8. Adequate renal function as follows (10% deviation allowed)

Entity relations:
- Has_value("renal function", "Adequate")